下列有關鼻咽（nasopharynx）之敘述，何者錯誤？
A. 後壁上有咽扁桃體（pharyngeal tonsil）
B. 側壁上有鼻咽管（nasopharyngeal tube）之開口
C. 經鼻後孔（choana）前通鼻腔
D. 上咽收縮肌（superior pharyngeal constrictor）形成其側壁及後壁

正確答案：B. 側壁上有鼻咽管（nasopharyngeal tube）之開口